E-B病毒（Epstein-Barr virus）急性感染後引起的單核球增多症（infectious mononucleosis），下列何種血清抗體最晚出現？
A. anti-VCA IgG
B. anti-VCA IgM
C. anti-EBNA Ab
D. anti-EA Ab

正確答案：C. anti-EBNA Ab